Patients with craniotomy for supratentorial tumors under general anesthesia

The above is a clinical trial inclusion criterion. Annotated with entity spans:
Patients with [Procedure: craniotomy] for [Condition: supratentorial tumors] under [Procedure: general anesthesia]